焦慮時下列何者不是其生理症狀？
A. 瞳孔縮小
B. 呼吸急促
C. 胸悶
D. 腹瀉

正確答案：A. 瞳孔縮小